Clinical trial exclusion criterion:
History of hypersensitivity to proteins (e.g., allergy shots).

Entity relations:
- Subsumes("hypersensitivity to proteins", "hypersensitivity to allergy shots")
- Has_temporal("hypersensitivity to allergy shots", "History")
- Has_temporal("hypersensitivity to proteins", "History")